A 30ºC, la butilamina reacciona con acrilato de etilo en KOH/EtOH y da:
1. N-Butilprop-2-enamida.
2. Prop-2-enoato de potasio.
3. 3-(Butilamino) propanoato de etilo.
4. No se forma ningún compuesto nuevo.
5. Buteno, etanol y prop-2-enamida.

Respuesta correcta: 3. 3-(Butilamino) propanoato de etilo.